Clinical trial inclusion criterion:
Type I or II diabetes mellitus.

Entity relations:
- OR("Type II diabetes mellitus", "Type I diabetes mellitus")